Clinical trial exclusion criterion:
Subject has an allergy or other known contraindication to the medications used in the study.

Annotated entities:
- Condition: "allergy"
- Condition: "contraindication"
- Drug: "medications used in the study"